以下何項特徵最可以區分心包膜填塞（cardiac tamponade）與限制性心包膜炎（constrictive pericarditis）？
A. 奇脈（pulsus paradoxus）
B. Kussmaul's sign
C. 第三心音（third heart sound）
D. 頸靜脈壓力波型呈現顯	的X波下降（prominent x descent）

正確答案：B. Kussmaul's sign